Clinical trial exclusion criterion:
RA cohort: Previous intolerance to MTX

Entity relations:
- AND("intolerance", "MTX")
- AND("RA", "intolerance")